Which diseases is microRNA 132 (miR-132) implicated in?

Several targets for for miR-132 have been described and it is implicated in many diseases such as:
neurodegenerative disease, 
epilepsy,
schizophrenia,
Huntington's disease (HD),
Alzheimer's disease (AD),
neuroinflammation,
osteosarcoma,
chronic lymphocytic leukemia (CLL),
angiogenesis,
eye disease,
alcoholic liver disease,
progressive supranuclear palsy (PSP taupathy),
mild cognitive impairment.